Clinical trial exclusion criterion:
Subjects who have received live or live attenuated vaccines within 6 weeks prior to the first dose of study drug (or the zoster vaccine)

Annotated entities:
- Drug: "live attenuated vaccines"
- Temporal: "within 6 weeks prior to the first dose of study drug"
- Reference_point: "the first dose of study drug"
- Multiplier: "first dose"
- Drug: "study drug"
- Drug: "zoster vaccine"
- Drug: "live vaccines"